Which scales are recommended by the American Heart Association for depression screening in cardiovascular patients?

Patient Health Questionnaire-2 (PHQ-2) and Patient Health Questionnaire-9 (PHQ-9) are recommended by the American Heart Association for depression screening in cardiovascular patients.